下列何種疾病之膽汁酸分泌狀況及血清膽汁酸值是正常的？
A. 杜賓-強森症候群（Dubin-Johnson syndrome）
B. 膽管閉鎖症
C. 家族性膽汁滯留症
D. 囊性纖維性（cystic fibrosis）引發肝病變

正確答案：A. 杜賓-強森症候群（Dubin-Johnson syndrome）